Clinical trial exclusion criterion:
received interferon or peginterferon treatment in the past.

Entity relations:
- AND("treatment", "interferon")
- Has_temporal("treatment", "in the past")
- OR("interferon", "peginterferon")